AUDIT score of < 5 or > 26

The above is a clinical trial exclusion criterion. Annotated with entity spans:
[Measurement: AUDIT] [Value: score of < 5 or > 26]